Inability to swallow or issues with malabsorption

The above is a clinical trial exclusion criterion. Annotated with entity spans:
[Condition: Inability to swallow] or [Condition: issues with malabsorption]